Clinical trial exclusion criterion:
1. Atrial fibrillation;

Annotated entities:
- Condition: "Atrial fibrillation"